Clinical trial inclusion criterion:
Normal hearing

Annotated entities:
- Condition: "Normal hearing"